Patients starting Adalimumab less than five half-lives after the interruption of a previous anti-TNF therapy.

The above is a clinical trial exclusion criterion. Annotated with entity spans:
Patients starting [Drug: Adalimumab] [Temporal: less than five half-lives after the interruption of a previous anti-TNF therapy].